72歲男性為慢性腎病病人，血中肌酸酐（creatinine）6.3 mg/dL，下列何種酸鹼電解質狀態最少發生在此病人？
A. 鈉（Na+）148 mEq/L
B. 鉀（K+）5.6 mEq/L
C. 磷（PO43-）5.5 mg/dL
D. 鈣（Ca++）8.0 mg/dL

正確答案：A. 鈉（Na+）148 mEq/L